Please list 3 small molecule CGRP-Receptor antagonists for migraine

Rimegepant and ubrogepant have been developed for acute migraine treatment, while atogepant is studied for migraine prophylaxis.